重鬱症（major depression）症狀完全消失（in full remission）指的是多久？
A. 兩週完全沒有憂鬱症狀
B. 兩個月完全沒有憂鬱症狀
C. 半年完全沒有憂鬱症狀
D. 一年完全沒有憂鬱症狀

正確答案：B. 兩個月完全沒有憂鬱症狀